Suspected subarachnoid hemorrhage;

The above is a clinical trial exclusion criterion. Annotated with entity spans:
Suspected [Condition: subarachnoid hemorrhage];